Clinical trial inclusion criterion:
All renal (only) male and female recipients aged = 60, years undergoing kidney transplantation from a living or deceased donor, including Expanded Criteria Donors (ECD).

Entity relations:
- Has_value("aged", "= 60")
- Subsumes("living donor", "Expanded Criteria Donors (ECD)")
- OR("male", "female")
- OR("living donor", "deceased donor")